腋下柺杖（axillary crutch）如果使用不當，最容易傷害到那一條神經？
A. 腋神經（axillary nerve）
B. 橈神經（radial nerve）
C. 正中神經（median nerve）
D. 尺神經（ulnar nerve）

正確答案：B. 橈神經（radial nerve）